Patient has any protocol-excluded or clinically significant medical or surgical history that could confound the study assessments

The above is a clinical trial exclusion criterion. Annotated with entity spans:
[Post-eligibility: Patient has any protocol-excluded or clinically significant medical or surgical history that could confound the study assessments]